Clinical trial exclusion criterion:
Secondary hypertension or malignant hypertension

Entity relations:
- OR("Secondary hypertension", "malignant hypertension")